List side effects of SGLT2 inhibitors?

SGLT2 inhibitors can be associated with urogenital infections related to the enhanced glycosuria, and low blood pressure.